Clinical trial exclusion criterion:
Patient previously treated with biologics.

Entity relations:
- Has_temporal("treated", "previously")
- AND("treated", "biologics")